Clinical trial exclusion criterion:
7. history of psychosis or other Axis I disorder that is primary;

Entity relations:
- Has_qualifier("Axis I disorder", "primary")
- Has_temporal("psychosis", "history")
- Has_temporal("Axis I disorder", "history")
- OR("psychosis", "Axis I disorder")